下列何種吸入性麻醉劑會增加腦部的代謝率？
A. halothane
B. nitrous oxide
C. desflurane
D. sevoflurane

正確答案：B. nitrous oxide